The patient underwent a successful transcutaneous implant procedure for an aortic valve within the past 24 hours

The above is a clinical trial inclusion criterion. Annotated with entity spans:
The patient underwent a successful [Procedure: transcutaneous implant procedure] for an [Device: aortic valve] within the [Temporal: past 24 hours]